Patients undergoing total hip or knee replacement who have been enrolled in this study for a prior hip or knee replacement;

The above is a clinical trial exclusion criterion. Annotated with entity spans:
P[Competing_trial: atients undergoing total hip or knee replacement who have been enrolled in this study for a prior hip or knee replacement;]